What is the effect of nocodazole cell treatment?

Nocodazole trigger mitotic arrest.